Clinical trial exclusion criterion:
and any obvious infection or inflammation over a period of at least 1 month before the study.

Annotated entities:
- Condition: "infection"
- Condition: "inflammation"
- Temporal: "at least 1 month before the study"
- Reference_point: "study"
- Qualifier: "obvious"